En el estándar de enfermería de los trastornos del estado de ánimo, en el diagnóstico enfermero “Desesperanza”, es posible identificar como intervención (NIC):
1. Facilitar el duelo.
2. Autocontrol de la agresión.
3. No es posible identificar ningún NIC porque es un problema de colaboración
4. Dar esperanza y apoyo emocional.
5. Manejo de ideas ilusorias.

Respuesta correcta: 4. Dar esperanza y apoyo emocional.